李小姐現年 30 歲，大學畢業後即擔任秘書工作，三年前開始右手會不自主甩動，接著是左手、臉部、及全身都會發生不自主動作，這種動作例如擠眉弄眼、扮鬼臉、聳肩、抬手、彈指、舉腿、或扭腰等等，在身體各部位出現，且愈來愈頻繁。一年前她也感覺到自己記憶力減低，常常打錯字。她的父親在 48 歲時也出現類似症狀，在 55 歲時自殺死亡。理學檢查正常，智力減低，神經學檢查無其他異常。最可能的診斷是：
A. 亨丁頓氏舞蹈症（Huntington's chorea）
B. 辛登南氏舞蹈症（Sydenham's chorea）
C. 高甲狀腺性舞蹈症
D. 中風性半邊舞蹈症

正確答案：A. 亨丁頓氏舞蹈症（Huntington's chorea）